Clinical trial inclusion criteria:
patients undergoing partial or full resection of the pancreas due to a benign or malignant tumor

Annotated entities:
- Procedure: "full resection of the pancreas"
- Procedure: "partial resection of the pancreas"
- Condition: "malignant tumor"
- Condition: "benign tumor"